肺癌病患若出現聲帶麻痺，最有可能是影響到那一條神經？
A. 膈神經（phrenic nerve）
B. 喉返神經（recurrent laryngeal nerve）
C. 交感神經幹（sympathetic trunk）
D. 肋間神經（intercostal nerve）

正確答案：B. 喉返神經（recurrent laryngeal nerve）